Clinical trial exclusion criterion:
3. Infection with HIV.

Annotated entities:
- Condition: "Infection with HIV"